Clinical trial exclusion criterion:
Life expectancy less than 12 months

Annotated entities:
- Observation: "Life expectancy"
- Value: "less than 12 months"